Clinical trial exclusion criterion:
Severe uncorrected insulin insufficiency

Annotated entities:
- Condition: "insulin insufficiency"
- Qualifier: "uncorrected"
- Qualifier: "Severe"